Clinical trial exclusion criterion:
Patients with active central nervous system (CNS) disease defined as symptomatic meningeal lymphoma or known CNS parenchymal lymphoma.

Entity relations:
- Has_qualifier("meningeal lymphoma", "symptomatic")
- AND("central nervous system (CNS) disease", "meningeal lymphoma")
- OR("meningeal lymphoma", "CNS parenchymal lymphoma")